Clinical trial exclusion criterion:
Who cannot read the informed consent form (e.g. illiteracy, foreigner)

Annotated entities:
- Informed_consent: "Who cannot read the informed consent form (e.g. illiteracy, foreigner)"